排尿時，膀胱逼尿肌（detrusor muscle）的收縮主要受到下列何種神經刺激？
A. 腎神經
B. 交感神經
C. 副交感神經
D. 體會陰神經（pudendal nerve）

正確答案：C. 副交感神經